Clinical trial inclusion criterion:
Must have received front line chemotherapy. No upper limit for the number of prior therapies

Annotated entities:
- Procedure: "chemotherapy"
- Qualifier: "front line"
- Not_a_criteria: "No upper limit for the number of prior therapies"